Clinical trial exclusion criterion:
Profound chorioretinal atrophy in central macular area on ophthalmoscopy and OCT;

Annotated entities:
- Qualifier: "Profound"
- Condition: "chorioretinal atrophy"
- Qualifier: "central macular area"
- Procedure: "ophthalmoscopy"
- Procedure: "OCT"